懷孕20週婦女，到婦產科門診接受產前檢查，胎兒二維（two-dimentional）超音波檢查發現胎兒腹部有腹壁缺損，初步判斷為omphalocele。下列處理何者錯誤？
A. 建議終止懷孕
B. 建議使用胎兒三維（three-dimentional）超音波檢查確定診斷
C. 建議使用MRI確定診斷
D. 告知胎兒染色體異常機會較高，可接受羊膜腔穿刺檢查

正確答案：A. 建議終止懷孕